下列關於非競爭型抑制劑（uncompetitive inhibitor）的敘述，何者正確？
A. 非競爭型抑制劑係結合於酵素的活性中心，使受質無法結合
B. 非競爭型抑制劑與酵素結合後會改變酵素活性中心的結構，阻斷反應的進行
C. 非競爭型抑制劑的存在會使酵素的 Km 上升
D. 酵素反應之 Vmax 不受非競爭型抑制劑的影響

正確答案：B. 非競爭型抑制劑與酵素結合後會改變酵素活性中心的結構，阻斷反應的進行